Which chromosome contains the TLR7 locus in the human genome?

The X chromosome. TLR7 is encoded on X chromosome Xp22.